Which R package could be used for the identification of pediatric brain tumors?

MethPed